¿Cuál es la ruta por excelencia en los mamíferos para la formación de NADPH?:
1. Ruta de las pentosas fosfato.
2. Glucólisis.
3. Ciclo de los ácidos tricarboxílicos.
4. Catabolismo de los ácidos grasos.

Respuesta correcta: 1. Ruta de las pentosas fosfato.